Clinical trial inclusion criterion:
Patients with relapsing forms of multiple sclerosis (RMS) with active disease defined by clinical or imaging features: (i) at least one clinical relapse over a 6-month period prior to screening; (ii) AND/OR at least one T1 gadolinium-enhancing lesion or new and/or enlarging T2 lesion as detected by brain Magnetic Resonance Imaging (MRI) performed over a 3 months period prior to screening with no change of Disease-Modifying Treatment(s) (DMT) compared to a previous MRI performed within 24 months before screening

Annotated entities:
- Qualifier: "relapsing forms"
- Condition: "multiple sclerosis (RMS)"
- Qualifier: "active disease"
- Observation: "imaging features"
- Observation: "clinical features"
- Multiplier: "at least one over a 6-month period"
- Condition: "clinical relapse"
- Temporal: "prior to screening"
- Multiplier: "at least one over a 3 months period"
- Temporal: "prior to screening"
- Condition: "T1 gadolinium-enhancing lesion"
- Condition: "T2 lesion"
- Procedure: "brain Magnetic Resonance Imaging (MRI)"
- Qualifier: "enlarging"
- Temporal: "new"
- Negation: "no"
- Multiplier: "change of"
- Procedure: "Disease-Modifying Treatment(s) (DMT)"
- Non-representable: "compared to a previous MRI performed within 24 months before screening"